5. Agents affecting gastric emptying (Motilium®, Prandase®, Victoza®, Byetta® and Symlin®) as well as oral anti-diabetic agents (Metformin, SGLT-2 inhibitors and DPP-4 inhibitors) if not at a stable dose for 3 months. Otherwise, these medications are acceptable and will be kept stable during the entire protocol.

The above is a clinical trial exclusion criterion. Annotated with entity spans:
[Parsing_Error: 5.] [Drug: Agents affecting gastric emptying] ([Drug: Motilium]®, [Drug: Prandase]®, [Drug: Victoza]®, [Drug: Byetta]® [Grammar_Error: and] [Drug: Symlin]®) as well as [Drug: oral anti-diabetic agents] ([Drug: Metformin], [Drug: SGLT-2 inhibitors] [Grammar_Error: and] [Drug: DPP-4 inhibitors]) if [Negation: not] at a [Qualifier: stable dose] [Temporal: for 3 months]. [Parsing_Error: Otherwise, these medications are acceptable and will be kept stable during the entire protocol.]